與肝硬化分級 Child-Pugh 系統無關之項目為：
A. 白蛋白
B. 凝血原時間
C. ALT 值
D. 膽色素（Bilirubin）

正確答案：C. ALT 值